為治療男性陰莖海綿體的勃起（erection）障礙，下列何者為最不可能採取的策略或方法？
A. 增加nitric oxide（NO）的合成量
B. 活化guanylyl cyclase的活性
C. 促進phosphodiesterase的活性
D. 延長cyclic GMP（cGMP）存在的時間

正確答案：C. 促進phosphodiesterase的活性